甲狀腺的觸診是診斷疾病的重要依據，根據1994年UNICEF（聯合國兒童基金會）的分類法，對甲狀腺大小 的分級描述何者正確？①甲狀腺組織看不到，也摸不到：Grade 0 ②甲狀腺組織看不到，但摸的到：Grade 
 1 ③甲狀腺組織看的到，也摸的到：Grade 2
A. 僅①②
B. 僅①③
C. 僅②③
D. ①②③

正確答案：D. ①②③